age over 40

The above is a clinical trial inclusion criterion. Annotated with entity spans:
[Person: age] [Value: over 40]